Extension of local tumor to involve adjacent organs other than seminal vesicles (T4)

The above is a clinical trial inclusion criterion. Annotated with entity spans:
[Condition: Extension of local tumor] to involve [Qualifier: adjacent organs] [Negation: other than] [Qualifier: seminal vesicles] (T4)